Pregnant patients or those who are breastfeeding will be deemed ineligible.

The above is a clinical trial exclusion criterion. Annotated with entity spans:
[Pregnancy_considerations: Pregnant patients or those who are breastfeeding will be deemed ineligible].